Clinical trial exclusion criterion:
Patients Level III or greater on the American Society of Anesthesiologists (ASA) physical status classification system (as determined by the anesthesiologist)

Annotated entities:
- Measurement: "American Society of Anesthesiologists (ASA) physical status"
- Value: "Level III or greater"